與牛乳相比，下列有關人乳成分（初乳除外）之描述何項錯誤？
A. 乳糖濃度較高
B. 鐵質濃度較高
C. IgA 抗體濃度較高
D. 乳清蛋白濃度較高

正確答案：B. 鐵質濃度較高